Which genes belong to the AUX/IAA family of transcription repressors in plants?

The Aux/IAA proteins are auxin-sensitive repressors that mediate diverse physiological and developmental processes in plants [1, 2]. Several DREB/CBF TFs directly promote transcription of the IAA5 and IAA19 genes in response to abiotic stress.  Auxin enhances the binding of Aux/IAA proteins to the receptor TIR1, which is an F-box protein that is part of the E3 ubiquitin ligase complex SCF(TIR1).